Clinical trial exclusion criterion:
Women in pregnancy or lactation, or female of child bearing potential without appropriate birth control measures.

Annotated entities:
- Pregnancy_considerations: "Women in pregnancy or lactation, or female of child bearing potential without appropriate birth control measures."